下列何種病變為第一型糖尿病自然病程中最早出現者？
A. 視網膜
B. 神經
C. 腎臟
D. 心血管

正確答案：A. 視網膜